What conditions are diagnosed using the scratch collapse test?

A diagnostic maneuver known as the "scratch-collapse test" (SCT), to aid in the diagnosis of compressive upper limb neuropathies such as carpal tunnel syndrome (CTS),